Respecto al reflejo tendinoso de Golgi:
1. Es monosináptico.
2. Los receptores están en serie con las fibras musculares extrafusales.
3. Está mediado por fibras aferentes tipo la y ll.
4. Activa motoneuronas α que inervan el músculo en que se localiza el receptor.
5. Es muy sensible a cambios de longitud muscular.

Respuesta correcta: 2. Los receptores están en serie con las fibras musculares extrafusales.